Have a cervical dilation of 2 centimeters or less, measured at the level of the internal os

The above is a clinical trial inclusion criterion. Annotated with entity spans:
Have a [Condition: cervical dilation] of [Multiplier: 2 centimeters or less], measured at the level of the [Qualifier: internal os]